Night or rotating shift workers

The above is a clinical trial exclusion criterion. Annotated with entity spans:
[Person: Night] or [Person: rotating shift workers]